Clinical trial inclusion criterion:
Elective TNTS resection of Pituitary Tumor

Annotated entities:
- Procedure: "TNTS resection"
- Condition: "Pituitary Tumor"
- Qualifier: "Elective"